Clinical trial exclusion criterion:
Acute or infectious inflammatory disease

Annotated entities:
- Condition: "inflammatory disease"
- Qualifier: "Acute"
- Qualifier: "infectious"